Clinical trial exclusion criterion:
1. Use of any medication within the 14 days prior to the initial dose of study medication.

Entity relations:
- Has_index("within the 14 days prior", "the initial dose of study medication")
- Has_temporal("medication", "within the 14 days prior")